Clinical trial inclusion criterion:
Patients with histologically confirmed diagnosis of prostate cancer who have not yet developed bone metastases

Entity relations:
- Has_value("histologically", "confirmed")
- AND("prostate cancer", "histologically")
- NOT("prostate cancer", "bone metastases")